¿Cuál de las siguientes características define a una depresión endógena?
1. Su curso es continuo.
2. Existe un empeoramiento vespertino.
3. Existe un despertar precoz.
4. Existe una buena respuesta al placebo.
5. En la etiopatogenia interviene una personalidad neurótica.

Respuesta correcta: 3. Existe un despertar precoz.